Clinical trial exclusion criterion:
Participation in another clinical trial within the past 90 days.

Annotated entities:
- Non-query-able: "Participation in another clinical trial within the past 90 days"